El error alcalino se define como:
1. Error que se comete cuando se valora una base fuerte.
2. Error que presenta un electrodo de vidrio cuando el medio es muy básico.
3. Error que se comete cuando se valora un ácido fuerte.
4. Error que afecta a un electrodo de referencia.
5. Error propio de los electrodos de membrana líquida.

Respuesta correcta: 2. Error que presenta un electrodo de vidrio cuando el medio es muy básico.